Clinical trial inclusion criterion:
Eastern Cooperative Oncology Group (ECOG) performance status =< 1

Entity relations:
- Subsumes("Eastern Cooperative Oncology Group performance status", "ECOG")
- Has_value("Eastern Cooperative Oncology Group performance status", "=< 1")